Clinical trial exclusion criterion:
Health condition considered unsafe for inclusion (at discretion of PI and/or attending physician)

Annotated entities:
- Condition: "Health condition"
- Qualifier: "considered unsafe for inclusion"
- Non-query-able: "at discretion of PI and/or attending physician"